Clinical trial exclusion criterion:
Women that underwent local radiation or chemotherapy within the last 12 months

Entity relations:
- Has_temporal("chemotherapy", "within the last 12 months")
- Has_temporal("local radiation", "within the last 12 months")
- OR("local radiation", "chemotherapy")